Clinical trial exclusion criterion:
Serious medical illness

Entity relations:
- Has_qualifier("medical illness", "Serious")